Clinical trial inclusion criterion:
Presence of documented ST-elevation myocardial infarction confirmed by ECG, as well as troponin I and CK-MB levels.

Entity relations:
- AND("ECG", "ST-elevation myocardial infarction")
- AND("troponin I", "ST-elevation myocardial infarction")
- AND("CK-MB", "ST-elevation myocardial infarction")